15 歲男孩被診斷為縱膈腔淋巴病變，欲進行頸部淋巴結切片手術，下列敘述何者錯誤？
A. 術前評估應注意是否有呼吸道受壓迫之問題
B. 術前評估若病人無呼吸窘迫現象，則麻醉過程就不會有呼吸道阻塞的問題
C. 病人有可能出現上腔靜脈受迫症候群
D. 此切片手術施行局部麻醉仍是最安全的選擇

正確答案：B. 術前評估若病人無呼吸窘迫現象，則麻醉過程就不會有呼吸道阻塞的問題